Patients with (highly) active RRMS disease course indicated to receive alemtuzumab according to the following conditions (at least 1 out of 3 conditions has to be fulfilled): 1. =2 MS relapses within 24 months, 2. clinical (=1 relapse) or MRI (new gadolinium enhancing lesions) disease activity under therapy with other diseasemodifying therapies, 3. severe relapse with high disease activity (=9 T2 hyperintense Lesions and =1 gadolinium enhancing lesion) on MRI.

The above is a clinical trial inclusion criterion. Annotated with entity spans:
Patients with (highly) [Qualifier: active] [Condition: RRMS] disease course indicated to receive [Drug: alemtuzumab] according to the following conditions (at least 1 out of 3 conditions has to be fulfilled): 1. [Multiplier: =2] [Condition: MS relapses] [Temporal: within 24 months,] 2. clinical ([Multiplier: =1] [Condition: relapse]) or [Procedure: MRI] ([Qualifier: new] [Qualifier: gadolinium enhancing] [Condition: lesions]) disease activity under therapy with other diseasemodifying therapies, 3. [Qualifier: severe] [Condition: relapse] with high disease activity ([Multiplier: =9] [Qualifier: T2 hyperintense] [Condition: Lesions] and [Multiplier: =1] [Qualifier: gadolinium enhancing] [Condition: lesion]) on [Procedure: MRI].